關於蠟狀桿菌（Bacillus cereus）的敘述，下列何者錯誤？
A. 耐熱的（heat-stable）毒素可造成嘔吐型食物中毒
B. 大多數環境中可發現此菌
C. 產生超級抗原（superantigen），可造成嚴重組織壞死（necrosis）
D. 可造成眼球感染，例如桿菌型全眼球炎（Bacillus panophthalmitis）

正確答案：C. 產生超級抗原（superantigen），可造成嚴重組織壞死（necrosis）